Produce una toxina que causa parálisis muscular flácida:
1. Streptococcus pyogenes.
2. Treponema pallidum.
3. Bordetella pertussis.
4. Clostridium botulinum.

Respuesta correcta: 4. Clostridium botulinum.